51 歲的趙先生是個農夫，一週前在田裡工作時腳部刺傷。昨天開始覺得下巴緊緊的打不太開，晚餐時嘴巴只能開一點點，還嗆到好幾次。今天早上被發現全身僵硬，躺在床上爬不起來。被送至急診室時身體姿勢呈現角弓反張（opisthotonos），臉部肌肉僵硬，牙關緊閉、嘴巴完全打不開。趙先生 的意識清醒，但呼吸有點急促，稍微碰他一下，他就全身痙攣。下列那一項診斷最有可能？
A. 破傷風（tetanus）
B. 有機磷中毒（organophosphate intoxication）
C. 癲癇發作（seizure）
D. 腦膜炎（meningitis）

正確答案：A. 破傷風（tetanus）